El complejo RISC (complejo silenciador inducido por RNA) del silenciamiento génico basado en RNA de interferencia:
1. Degrada la hebra guía de las moléculas de RNA pequeño de interferencia (siRNA).
2. Reconoce proteínas defectuosas y promueve su degradación.
3. Tiene una estructura similar al ribosoma, formado por numerosos RNAs y proteínas.
4. Está formado, entre otras, por la proteína Dicer, una ribonucleasa de tipo III.
5. Forma parte tanto del mecanismo de interferencia de los siRNA como de los microRNA.

Respuesta correcta: 5. Forma parte tanto del mecanismo de interferencia de los siRNA como de los microRNA.